Clinical trial exclusion criterion:
Active bleeding or known significant bleeding risk (e.g., gastrointestinal ulcer, malignant neoplasms, injuries or recent surgeries of the brain, spinal cord or eyes, recent intracranial bleedings, known or suspected esophagus varices, aneurysms or intraspinal or intracranial vascular abnormalities)

Entity relations:
- Has_qualifier("bleeding risk", "significant")
- Has_qualifier("vascular abnormalities)", "intraspinal")
- Has_qualifier("surgeries", "brain")
- Subsumes("bleeding risk", "gastrointestinal ulcer")
- OR("Active bleeding", "bleeding risk")
- OR("brain", "spinal cord", "eyes")
- OR("intraspinal", "intracranial")
- OR("gastrointestinal ulcer", "aneurysms", "esophagus varices", "intracranial bleedings", "surgeries", "injuries", "malignant neoplasms", "vascular abnormalities)")